La azatioprina es un profármaco de la 6mercaptopurina y se utiliza como inmunosupresor. ¿Cómo se transforma en 6mercaptopurina?:
1. Ataque nucleofílico del glutatión.
2. Hidrólisis por esterasas.
3. Hidrólisis por sulfatasa.
4. Por acción de la xantina oxidasa.

Respuesta correcta: 1. Ataque nucleofílico del glutatión.